¿Qué son el optimismo y el pesimismo defensivo?:
1. Dos tipos de expectativas de autoeficacia propuestos por Bandura.
2. Dos tipos de unidades cognitivas propuestas por Mischel.
3. Dos tipos de atribuciones propuestas por Weiner.
4. Dos tipos de estrategias cognitivas propuestas por Cantor y Norem.

Respuesta correcta: 4. Dos tipos de estrategias cognitivas propuestas por Cantor y Norem.